70歲女性，因雙側下肢水腫，氣促，呼吸困難來門診就醫，身體診察發現雙側肺囉音，心音發現S3 gallop，心臟超音波顯示左心室射出分率為55%，輕度二尖瓣及三尖瓣逆流合併舒張功能不良，有關下列敘述何者錯誤？
A. B-type natriuretic peptide（BNP）或者N-terminal pro-BNP可做為評估疾病嚴重度的指標
B. 飲食的衛教方面應該限鹽
C. 使用angiotensin-converting enzyme inhibitor已被證明對於此類病患長期的預後有幫助，應即刻開始使用
D. 使用利尿劑改善症狀並控制好血壓是治療病患的首選做法

正確答案：C. 使用angiotensin-converting enzyme inhibitor已被證明對於此類病患長期的預後有幫助，應即刻開始使用